Clinical trial inclusion criterion:
Male or female = 18 years of age at Visit 1.

Annotated entities:
- Person: "Male"
- Person: "female"
- Person: "age"
- Temporal: "at Visit 1."
- Reference_point: "Visit 1"
- Value: "= 18 years"